脊髓白質之外側束（lateral funiculus）含有下列何種神經傳導徑路？
A. 背柱內側蹄系（dorsal column-medial lemniscus system）
B. 外側皮質脊髓徑（lateral corticospinal tract）
C. 前庭脊髓徑（vestibulospinal tract）
D. 四疊體脊髓徑（tectospinal tract）

正確答案：B. 外側皮質脊髓徑（lateral corticospinal tract）